精神狀態檢查中有關衝動（impulsivity）評估，下列何者錯誤？
A. 衝動評估包含了對性衝動、攻擊衝動，以及其他衝動的控制能力
B. 人格疾患不會有衝動控制不佳的症狀
C. 衝動評估必須確認病人有社會化適切行為（socially approriate behavior）的覺察能力
D. 衝動評估是評估病人對自己與他人所造成的潛在危險

正確答案：B. 人格疾患不會有衝動控制不佳的症狀